Inability to take aspirin at a dosage of 100 mg or less

The above is a clinical trial inclusion criterion. Annotated with entity spans:
[Condition: Inability to take] [Drug: aspirin] at a dosage of [Multiplier: 100 mg or less]